Clinical trial inclusion criterion:
Willing and able to comply with the study procedures and provide written informed consent to participate in the study

Annotated entities:
- Non-query-able: "Willing and able to comply with the study procedures and provide written informed consent to participate in the study"